當眼眶（orbit）骨折時，最易因眼眶內之肌肉掉入下列何鼻竇，而產生複視（diplopia）？
A. 上頜竇（maxillary sinus）
B. 後篩竇（posterior ethmoidal sinus）
C. 額竇（frontal sinus）
D. 前篩竇（anterior ethmoidal sinus）

正確答案：A. 上頜竇（maxillary sinus）